Clinical trial exclusion criterion:
signs for central dysfunction

Annotated entities:
- Mood: "signs"
- Condition: "central dysfunction"